symptomatic atherosclerosis of the carotid artery;

The above is a clinical trial exclusion criterion. Annotated with entity spans:
[Qualifier: symptomatic] [Condition: atherosclerosis] [Qualifier: of the carotid artery];